Clinical trial exclusion criterion:
Renal impairment

Annotated entities:
- Condition: "Renal impairment"